La proporción de varianza ambiental debida a las influencias que recibe una persona de su entorno familiar y que son compartidas por el resto de su familia:
1. Es la varianza específica.
2. Se denomina varianza genotípica.
3. Coincide con la heredabilidad.
4. Se desestima en las investigaciones.
5. Es la varianza proveniente del ambiente compartido.

Respuesta correcta: 5. Es la varianza proveniente del ambiente compartido.